有位20歲的大學生因服用過量的藥品，引發癲癇而被送到急診部，她的室友描述該生曾經口服某種藥物會造成失眠。下列何者被用來治療氣喘病人的氣管痙孿，且易引發失眠及癲癇？
A. ipratropium
B. theophylline
C. cromolyn
D. metaproterenol

正確答案：B. theophylline